Clinical trial exclusion criterion:
Known coronary artery disease or type I DM with microvascular complications or signs of heart failure or clinical dissection of the aorta

Annotated entities:
- Condition: "coronary artery disease"
- Condition: "type I DM"
- Condition: "microvascular complications"
- Condition: "heart failure"
- Condition: "dissection of the aorta"